Clinical trial exclusion criterion:
Any clinically significant laboratory test result

Annotated entities:
- Qualifier: "clinically significant"
- Procedure: "laboratory test"
- Undefined_semantics: "Any clinically significant laboratory test result"
- Subjective_judgement: "Any clinically significant laboratory test result"